下列何者是副交感神經興奮的正確反應？
A. Mydriasis
B. Vasoconstriction
C. 降低 basal metabolic rate
D. 眼睛之 Ciliary muscle 收縮

正確答案：D. 眼睛之 Ciliary muscle 收縮